Known or suspected non-compliance, drug or alcohol abuse

The above is a clinical trial exclusion criterion. Annotated with entity spans:
Known or suspected [Qualifier: non-compliance], [Condition: drug] or [Condition: alcohol abuse]